白血病患童，若白血球數目高於十萬時，屬腫瘤急症，可能會併發各種問題，下列何項最不會出現？
A. 高尿酸血症（Hyperuricemia）
B. 血栓形成（Thrombosis）
C. 腹瀉（Diarrhea）
D. 缺氧（Hypoxia）

正確答案：C. 腹瀉（Diarrhea）